Clinical trial inclusion criterion:
Forced expiratory volume (FEV1)< 30% predicted

Annotated entities:
- Measurement: "Forced expiratory volume"
- Measurement: "FEV1"
- Value: "< 30% predicted"